一般常以結構面、過程面、結果面來衡量醫療服務之品質，下列有關醫療品質之敘述何者正確？
A. 醫院評鑑之目的在確保醫療結構面之品質
B. 一般健康指標（如死亡率）可靈敏反映出醫療照護結果
C. 抗生素使用率為醫療過程面品質指標
D. 剖腹產率為結果面品質指標

正確答案：C. 抗生素使用率為醫療過程面品質指標